Hepatitis B or C infection

The above is a clinical trial exclusion criterion. Annotated with entity spans:
[Condition: Hepatitis B] or C infection